Señale cuál de la siguientes es una característica de la ataxia cerebelosa:
1. Defecto de la sensibilidad propioceptiva.
2. Dismetría.
3. El desequilibrio empeora cuando el enfermo cierra los ojos (signo de Romberg +).
4. Rigidez.

Respuesta correcta: 2. Dismetría.